What percentage of C. elegans genes reside in operons?

Approximately 15% of the genes in C. elegans are operons.